Clinical trial exclusion criterion:
Preoperative history of schizophrenia, epilepsy, parkinsonism or myasthenia gravis;

Annotated entities:
- Condition: "schizophrenia"
- Condition: "epilepsy"
- Condition: "parkinsonism"
- Condition: "myasthenia gravis"
- Temporal: "history"
- Temporal: "Preoperative"